Having plan to be pregnant;

The above is a clinical trial exclusion criterion. Annotated with entity spans:
Having [Mood: plan] to be [Condition: pregnant];